Clinically stable for at least 1 month prior to entry into the study

The above is a clinical trial inclusion criterion. Annotated with entity spans:
Clinically [Condition: stable] [Temporal: for at least 1 month prior to entry into the study]